Clinical trial inclusion criterion:
Males and females with confirmed disease: Fabry (by GLA enzymes and/or DNA testing) naïve and on ERT, Mitochondrial diseases (electron transport chain and/or DNA testing) or connective tissue diseases (clinical criteria and/or DNA testing when available)

Entity relations:
- AND("Fabry naïve", "GLA enzymes")
- AND("Mitochondrial diseases", "electron transport chain")
- Has_context("connective tissue diseases", "clinical criteria")
- Subsumes("confirmed disease", "Fabry naïve")
- Subsumes("confirmed disease", "ERT")
- OR("Males", "females")
- OR("GLA enzymes", "DNA testing")
- OR("electron transport chain", "DNA testing")
- OR("clinical criteria", "DNA testing")
- OR("Fabry naïve", "Mitochondrial diseases", "connective tissue diseases")
- OR("ERT", "Mitochondrial diseases", "connective tissue diseases")